Clinical trial inclusion criteria:
Menopausal women with breast cancer treated and using tamoxifen or aromatase inhibitor.
With hot flashes and with or without active sexual life.

Annotated entities:
- Condition: "Menopausal"
- Person: "women"
- Condition: "breast cancer"
- Procedure: "treated"
- Drug: "tamoxifen"
- Drug: "aromatase inhibitor"
- Condition: "hot flashes"
- Observation: "without active sexual life"
- Observation: "with active sexual life"